Clinical trial exclusion criterion:
Patients with uncontrolled hypertension

Annotated entities:
- Condition: "uncontrolled hypertension"